Según la propuesta de la Organización Mundial de la Salud, podemos afirmar que el término de “envejecimiento activo”:
1. Se interpreta como la necesidad de seguir siendo activo físicamente en la vejez.
2. Pretende denominar un concepto más amplio que el de envejecimiento saludable.
3. Se adopta por primera vez tras la Segunda Asamblea Mundial sobre el envejecimiento.
4. Se define como el proceso de promoción de la salud de las personas que envejecen.
5. Pretende expresar los importantes beneficios del ejercicio en la vejez.

Respuesta correcta: 2. Pretende denominar un concepto más amplio que el de envejecimiento saludable.